以下關於痙攣（spasm）of the sphincter of Oddi的敘述何者錯誤？
A. 偶而會有AST，ALT或alkaline phosphatase升高現象
B. 常有右上腹或上腹疼痛，類似膽結石之症狀
C. sphincter of the Oddi manometry有助於診斷
D. 對於疼痛嚴重的病人，morphine是最適當的止痛劑

正確答案：D. 對於疼痛嚴重的病人，morphine是最適當的止痛劑